Clinical trial inclusion criterion:
Normal neurologic exam and normal mental status

Entity relations:
- Has_value("neurologic exam", "Normal")
- OR("normal", "mental status")